有關在膈神經（phrenic nerve）頸根處相關位置的敘述，何者正確？
A. 位於鎖骨下靜脈（subclavian vein）的前方
B. 走在前斜角肌（anterior scalene muscle）的前面
C. 位於總頸動脈（common carotid artery）的內側
D. 走在臂神經叢（brachial plexus）的後面

正確答案：B. 走在前斜角肌（anterior scalene muscle）的前面